依據Denis的分類，下列何處胸腰椎受傷（thoracolumbar injuries）會被認為不穩定？
A. 前柱（anterior column）
B. 中柱（middle column）
C. 後柱（posterior column）
D. 胸腰椎交界處（thoracolumbar junction）

正確答案：B. 中柱（middle column）